Clinical trial exclusion criterion:
Need for chronic oral anticoagulant therapy

Annotated entities:
- Mood: "Need for"
- Procedure: "chronic oral anticoagulant therapy"